Adequate liver function - serum total bilirubin concentration less than 1.5 x upper limit of normal value

The above is a clinical trial inclusion criterion. Annotated with entity spans:
[Value: Adequate] [Measurement: liver function] - [Measurement: serum total bilirubin concentration] [Value: less than 1.5 x upper limit of normal value]